Clinical trial inclusion criterion:
Subjects with a history of moderate to severe psoriatic disease

Entity relations:
- Has_qualifier("psoriatic disease", "moderate")
- Has_temporal("psoriatic disease", "history")
- OR("moderate", "severe")